What condition is usually represented by the acronym SUDEP?

Sudden Unexpected Death in Epilepsy (SUDEP)